Clinical trial exclusion criterion:
No concurrent use of other investigational drugs or antineoplastic therapies.

Entity relations:
- Has_negation("other investigational drugs", "No")
- OR("other investigational drugs", "antineoplastic therapies")